一位 60歲的婦人患有第一型糖尿病已逾40年，餐後常有嚴重的胃部脹氣，經診斷後確認為糖尿病併發的胃癱軟無力 （gastroparesis）。下列何者為可用來治療此症狀的prokinetic藥物？
A. alosetron
B. metoclopramide
C. loperamide
D. sucralfate

正確答案：B. metoclopramide